有關椎間盤突出引致（intervertebral disc herniation induced）之神經根病變（radiculopathy），下列敘述何者錯誤？
A. 好發於 30～60 歲
B. 可能出現局部肌肉萎縮
C. 胸椎為好發部位
D. 肌腱反射低下

正確答案：C. 胸椎為好發部位